Clinical trial inclusion criterion:
Age between 0 and 18 years

Annotated entities:
- Person: "Age"
- Value: "between 0 and 18 years"